Weigh >300 lbs

The above is a clinical trial exclusion criterion. Annotated with entity spans:
[Measurement: Weigh] [Value: >300 lbs]